Clinical trial inclusion criterion:
Age 18 or above, or of legal age to give informed consent specific to state and national law

Entity relations:
- Has_value("Age", "18 or above")
- OR("18 or above", "of legal age")